Clinical trial exclusion criterion:
Patients with fluid restriction or who are unable to drink up to 900 ml of fluid within 10 minutes prior to the VCE

Annotated entities:
- Observation: "fluid restriction"
- Observation: "unable to drink"
- Temporal: "prior to the VCE"
- Procedure: "VCE"
- Reference_point: "the VCE"